Clinical trial inclusion criterion:
Those who age between 30 and 80 years old and can inject insulin by themselves.

Annotated entities:
- Value: "between 30 and 80 years old"
- Person: "age"
- Observation: "can"
- Procedure: "inject insulin"